Progressive, unstable or uncontrolled clinical conditions.

The above is a clinical trial exclusion criterion. Annotated with entity spans:
[Qualifier: Progressive], [Qualifier: unstable] or [Qualifier: uncontrolled] [Condition: clinical conditions].